下列何者可用於裂解一個蛋白質，決定其內含之胺基酸成分：
A. 6 N HCl
B. 8 N NaOH
C. 8 M urea
D. 6 M guanidine HCl

正確答案：A. 6 N HCl